(3) women have experienced two or more implantation failure attributed to inadequate endometrial development.

The above is a clinical trial inclusion criterion. Annotated with entity spans:
(3) [Person: women] have experienced [Multiplier: two or more] [Procedure: implantation] [Qualifier: failure] [Mood: attributed to] [Condition: inadequate endometrial development].